下列有關子宮外孕（ectopic pregnancy）的敘述，何者錯誤？
A. 子宮外孕最常見的著床位置是在輸卵管
B. 輸卵管峽部（isthmus）為輸卵管外孕（ectopic tubal pregnancy）最常發生的著床位置
C. 子宮外孕可能著床於卵巢
D. 右側輸卵管外孕，若引起輸卵管破裂時，其臨床表現類似闌尾炎

正確答案：B. 輸卵管峽部（isthmus）為輸卵管外孕（ectopic tubal pregnancy）最常發生的著床位置